Which deiodinases are present in skeletal  muscle?

Type 2 and Type 3 deiodinases are expressed in skeletal muscle and their expression is modulated by disease state and fasting.